Alkaline phosphatase: ≤ 2.5 x ULN

The above is a clinical trial inclusion criterion. Annotated with entity spans:
[Measurement: Alkaline phosphatase]: [Value: ≤ 2.5 x ULN]